Clinical trial exclusion criterion:
Presence of cardiovascular comorbidities

Annotated entities:
- Condition: "cardiovascular comorbidities"